En un paciente postoperado de una derivación urinaria, la enfermera debe vigilar el volumen urinario cada hora. ¿Por debajo de cuántos ml/h de orina puede indicar que el paciente está deshidratado o presenta algún tipo de obstrucción o pérdida interna?:
1. 200 ml/h.
2. 100 ml/h.
3. 80 ml/h.
4. 50 ml/h.
5. 30 ml/h.

Respuesta correcta: 5. 30 ml/h.